Female subjects between 16 and 40 years or women older than 40 years with a cessation of ovarian function before the age of 40 years with increased levels of FSH

The above is a clinical trial inclusion criterion. Annotated with entity spans:
[Person: Female] subjects [Value: between 16 and 40 years] or [Person: women] [Value: older than 40 years] with a [Condition: cessation of ovarian function] [Value: before the age of 40 years] with [Value: increased] [Measurement: levels of FSH]